翼管神經（nerve of pterygoid canal）不包含：
A. 交感神經之節後纖維
B. 副交感神經之節前纖維
C. 來自於岩小神經（lesser petrosal nerve）之神經纖維
D. 來自於岩深神經（deep petrosal nerve）之神經纖維

正確答案：C. 來自於岩小神經（lesser petrosal nerve）之神經纖維